selective operation of inguinal hernia repair<U+3001>orthopedics operation or general surgery operation in children

The above is a clinical trial inclusion criterion. Annotated with entity spans:
selective operation of [Procedure: inguinal hernia repair]<U+3001>[Procedure: orthopedics operation] or [Procedure: general surgery operation] in [Person: children]